Clinical trial exclusion criterion:
surgical interventions within the last 4 days,

Entity relations:
- Has_temporal("surgical interventions", "last 4 days")